62歲男性有高血壓病史，但不規則服藥，因左下腹痛兩天來到急診，發燒38.5℃，血壓90/60 mmHg，心跳每分	110次，理學檢查左下腹明顯有壓痛硬塊，肛門指診出現黏液血便，抽血結果白血球22,000/μL，血紅素9.7 g/dL。依據前述情況，其最不適宜的檢查為：
A. 大腸鏡（colonoscopy）
B. 電腦斷層（CT）
C. 胸部X光（CXR）
D. 左側躺腹部X光（left lateral decubitus）

正確答案：A. 大腸鏡（colonoscopy）